合成腎上腺皮質素（cortisol）所需要的21-β hydroxylase 缺乏，不會產生下列何種變化？
A. 促腎上腺皮質激素（ACTH）分泌會代償性的增加
B. 如為女性患者可能會造成腎上腺性徵異常綜合症（adrenogenital syndrome）
C. 腎上腺皮質分泌的雄性素（androgen）會隨之增加
D. 皮質酮（corticosterone）的分泌會代償性的增加

正確答案：D. 皮質酮（corticosterone）的分泌會代償性的增加